Clinical trial exclusion criterion:
In the list of heart transplantation;

Annotated entities:
- Procedure: "heart transplantation"
- Mood: "In the list"